Clinical trial exclusion criterion:
History of moderate to severe traumatic brain injury or mild traumatic brain injury with ongoing post-concussive symptoms;

Annotated entities:
- Condition: "traumatic brain injury"
- Qualifier: "moderate"
- Qualifier: "severe"
- Condition: "traumatic brain injury"
- Qualifier: "mild"
- Condition: "post-concussive symptoms"